Clinical trial exclusion criterion:
Patients taking any experimental therapies history of another malignancy within 5 years prior to study entry except curatively treated non-melanoma skin cancer, prostate cancer, or cervical cancer in situ

Entity relations:
- Has_temporal("another malignancy", "within 5 years prior to study entry")
- Has_qualifier("non-melanoma skin cancer", "curatively treated")
- Has_temporal("another malignancy", "history of")
- Has_negation("non-melanoma skin cancer", "except")
- AND("another malignancy", "non-melanoma skin cancer")
- OR("non-melanoma skin cancer", "prostate cancer", "cervical cancer in situ")